下列何者是最常見的眼瞼癌症？
A. 皮脂腺癌
B. 鱗狀細胞癌
C. 基底細胞癌
D. 惡性黑素瘤

正確答案：C. 基底細胞癌